Aspirin, ticagrelor or clopidogrel allergies;

The above is a clinical trial exclusion criterion. Annotated with entity spans:
[Drug: Aspirin], [Drug: ticagrelor] or [Drug: clopidogrel] [Condition: allergies];